Treprostinil contraindications: Known hypersensitivity to treprostinil or any of the excipients, Pulmonary arterial hypertension related to veno-occlusive disease, Congestive heart failure due to severe left ventricular dysfunction, Severe hepatic insufficiency (Child-Pugh stage C), Evolving gastrointestinal ulcer, intracranial hemorrhage, recent trauma or other clinical condition that may lead to bleeding, Congenital or acquired valvular abnormalities with cardiac repercussions, Severe ischemic heart disease or unstable angina; Myocardial infarction in the last six months; Decompensated cardiac insufficiency not medically controlled; Severe arrhythmias; Cerebrovascular lesions (such as transient ischemic attack, stroke) that occurred within the last three months.

The above is a clinical trial exclusion criterion. Annotated with entity spans:
[Drug: Treprostinil] [Condition: contraindications]: Known [Condition: hypersensitivity] to [Drug: treprostinil] or [Drug: any of the excipients], [Condition: Pulmonary arterial hypertension] related to [Condition: veno-occlusive disease], [Condition: Congestive heart failure] due to [Qualifier: severe] [Condition: left ventricular dysfunction], [Qualifier: Severe] [Condition: hepatic insufficiency] ([Measurement: Child-Pugh] [Value: stage C]), [Qualifier: Evolving] [Condition: gastrointestinal ulcer], [Condition: intracranial hemorrhage], [Temporal: recent] [Condition: trauma] or other [Condition: clinical condition that may lead to bleeding], [Condition: Congenital] or [Condition: acquired valvular abnormalities] [Qualifier: with cardiac repercussions], [Qualifier: Severe] [Condition: ischemic heart disease] or [Condition: unstable angina]; [Condition: Myocardial infarction] [Temporal: in the last six months]; [Condition: Decompensated cardiac insufficiency] [Qualifier: not medically controlled]; [Qualifier: Severe] [Condition: arrhythmias]; [Condition: Cerebrovascular lesions] (such as [Condition: transient ischemic attack], [Condition: stroke]) that occurred [Temporal: within the last three months].